Clinical trial exclusion criterion:
14. Use of experimental or unapproved immunosuppressant

Entity relations:
- Has_qualifier("immunosuppressant", "experimental")
- OR("experimental", "unapproved")